Clinical trial exclusion criterion:
Subjects with ectatic eye disorders.

Annotated entities:
- Condition: "ectatic eye disorders"